Clinical trial exclusion criterion:
Allergic to studied drugs or metal materials.

Entity relations:
- AND("Allergic", "studied drugs")
- OR("studied drugs", "studied metal materials")